一位三歲小男生被帶至急診，家屬陳述早晨起床時抱怨喉嚨痛與全身倦怠，傍晚即出現聲音異常，頸部伸直、呼吸急促、流涎，診斷為急性會厭炎（epiglottitis），下列何者正確？
A. 立即以壓舌板檢查喉嚨是否有感染
B. 胸部X光片可見氣管影像成尖塔狀（steeple sign）
C. 可能須給予氣管內插管
D. 可能為病毒感染，不需立即使用抗生素

正確答案：C. 可能須給予氣管內插管